Clinical trial exclusion criterion:
Severe Arrhythmia including atrial fibrillation, atrial flutter, ventricular fibrillation, ventricular flutter or ventricular tachycardia.

Entity relations:
- Has_qualifier("Arrhythmia", "Severe")
- Subsumes("Arrhythmia", "atrial fibrillation")
- OR("atrial fibrillation", "atrial flutter", "ventricular fibrillation", "ventricular flutter", "ventricular tachycardia")